Severe renal dysfunction, defined as:

The above is a clinical trial exclusion criterion. Annotated with entity spans:
[Qualifier: Severe] [Condition: renal dysfunction], defined as: